Clinical trial exclusion criterion:
13. HIV medications: efavirenz, etravirine, all ritonavir boosted and unboosted HIV protease inhibitors

Annotated entities:
- Parsing_Error: "13."
- Drug: "HIV protease inhibitors"
- Drug: "ritonavir"
- Drug: "etravirine"
- Qualifier: "ritonavir unboosted"
- Qualifier: "ritonavir boosted"
- Grammar_Error: "and"
- Drug: "efavirenz"